某 45 歲男性經診斷罹患右側腎臟 perirenal abscess，大小約 2.5 cm 右腎功能仍屬正常，最合理的處置 為何？
A. 腎切除術
B. 局部腎切除術
C. 開腹式引流
D. 經皮穿刺引流

正確答案：D. 經皮穿刺引流